Clinical trial exclusion criterion:
Initiation or change of dosage of bosentan, sildenafil or calcium channel blockers in the previous month or in the following month

Entity relations:
- Has_temporal("bosentan", "in the previous month")
- AND("bosentan", "sildenafil")
- AND("sildenafil", "calcium channel blockers")
- OR("in the previous month", "in the following month")